Clinical trial inclusion criterion:
with written parental consent

Annotated entities:
- Informed_consent: "with written parental consent"